Clinical trial exclusion criterion:
Cardio-vascular pathologies, evoluting and uncontrolled, (severe HTA), cardiac deficiency, severe angor, severe arrhythmia.

Entity relations:
- Has_qualifier("arrhythmia", "severe")
- Has_qualifier("angor", "severe")
- Has_qualifier("HTA", "severe")
- OR("evoluting", "uncontrolled")
- OR("Cardio-vascular pathologies", "HTA", "cardiac deficiency", "angor", "arrhythmia", "evoluting")